Clinical trial inclusion criterion:
Healthy subjects or subjects with well controlled underlying disease.

Annotated entities:
- Condition: "Healthy"
- Condition: "underlying disease"
- Qualifier: "well controlled"